Clinical trial exclusion criterion:
Intention to deliver in a maternity not linked to the study

Annotated entities:
- Post-eligibility: "Intention to deliver in a maternity not linked to the study"